Clinical trial inclusion criterion:
Severe chronic kidney disease (Stage 4 and 5)

Annotated entities:
- Condition: "chronic kidney disease"
- Qualifier: "Severe"
- Condition: "Stage 4 chronic kidney disease"
- Condition: "Stage 5 chronic kidney disease"
- Grammar_Error: "and"